What are acoustic reported genes used to detect?

acoustic reporter genes , which are genetic constructs that allow bacterial gene expression to be visualized in vivo using ultrasound ,